Clinical Dementia Rating (CDR) test inferior or equal to 1

The above is a clinical trial inclusion criterion. Annotated with entity spans:
[Measurement: Clinical Dementia Rating (CDR) test] [Value: inferior or equal to 1]